Clinical trial exclusion criteria:
Systemic diseases (diabetes, renal diseases, rheumatic diseases, osteoporosis and cardiovascular diseases)
Pregnant and lactating women
HIV/ AIDS
periodontal treatment in the last year (before baseline appointment)
Medication: Immunosuppressive drugs, antibiotics in the past three months (before baseline appointment) )
orthodontic appliance

Annotated entities:
- Condition: "Systemic diseases"
- Condition: "Pregnant"
- Condition: "lactating"
- Person: "women"
- Condition: "HIV"
- Condition: "AIDS"
- Procedure: "periodontal treatment"
- Temporal: "in the last year"
- Temporal: "before baseline appointment"
- Procedure: "baseline appointment"
- Reference_point: "baseline appointment"
- Drug: "Immunosuppressive drugs"
- Drug: "antibiotics"
- Temporal: "in the past three months"
- Temporal: "before baseline appointment"
- Procedure: "baseline appointment"
- Reference_point: "baseline appointment"
- Device: "orthodontic appliance"